常壓性水腦症（normal pressure hydrocephalus, NPH）經過腦室引流手術後，最容易改善的症狀是下列何者？
A. 尿失禁
B. 痴呆
C. 步態不穩
D. 半身無力

正確答案：A. 尿失禁